Which drugs are included in the MAID chemotherapy regimen for sarcoma?

MAID chemotherapy regimen for sarcomas include mesna, adriamycin, ifosfamide and dacarbazine.